Clinical trial inclusion criterion:
Male and females aged 18 to 70 years

Annotated entities:
- Person: "Male"
- Person: "females"
- Person: "aged"
- Value: "18 to 70 years"